performance status ECOG = 2 (Eastern Cooperative Oncology Group)

The above is a clinical trial inclusion criterion. Annotated with entity spans:
[Measurement: performance status] [Measurement: ECOG] [Value: = 2] ([Measurement: Eastern Cooperative Oncology Group])